¿Cuál de los siguientes excipientes NO se utiliza como colorante en la elaboración de formas farmacéuticas?:
1. Óxido de hierro.
2. Dióxido de titanio.
3. Ferrocianuros férricos.
4. Maltol.

Respuesta correcta: 4. Maltol.